一位 30 歲之初產婦懷孕 36 週時因高血壓（170/120 mm/Hg）及蛋白尿（3.1 g/24 hours）住院，住院時發現patellar reflex有增加的情況，主治醫師隨即指示給予MgSO4。給予MgSO4之前，下列何種檢驗數據為絕對必須？
A. 肝功能
B. 腎功能
C. 凝血功能
D. 血小板功能

正確答案：B. 腎功能